第一次感染Epstein-Barr virus 所致之傳染性單核球增多症（Infectious mononucleosis），在急性期血清的 EBV特異性抗體檢查結果，以下何者最為可能？
A. anti-VCA IgM（-）、anti-VCA IgG（+）、anti-EBNA Ab NEA（+）
B. anti-VCA IgM（+）、anti-VCA IgG（+）、anti-EBNA Ab NEA（+）
C. anti-VCA IgM（+）、anti-VCA IgG（+）、anti-EBNA Ab NEA（-）
D. anti-VCA IgM（-）、anti-VCA IgG（-）、anti-EBNA Ab NEA（+）

正確答案：C. anti-VCA IgM（+）、anti-VCA IgG（+）、anti-EBNA Ab NEA（-）